Clinical trial exclusion criterion:
Evidence of iron overload or disturbances in the utilisation of iron

Annotated entities:
- Condition: "iron overload"
- Condition: "disturbances in the utilisation of iron"
- Drug: "iron"
- Drug: "iron"